Un hombre de 60 años de edad con colitis ulcerosa extensa de 15 años de evolución y en remisión clínica los últimos 3 años, acude a nuestra consulta para informarse sobre el riesgo de cáncer colorrectal y sobre la posibilidad de participar en programas de prevención. Es correcto informarle que:
1. La colitis ulcerosa solo se asocia a un incremento en el riesgo de cáncer colorrectal en fumadores.
2. En su caso, dado que está en remisión de larga duración, se considera adecuado el cribado aconsejado a la población general.
3. En casos como el suyo se considera adecuado someterse a colonoscopias periódicas con toma de múltiples biopsias escalonadas a lo largo de todo el colon.
4. En casos como el suyo se considera adecuado el cribado mediante estudios periódicos de sangre oculta en heces pero con una frecuencia superior a la utilizada en el cribado de la población general.

Respuesta correcta: 3. En casos como el suyo se considera adecuado someterse a colonoscopias periódicas con toma de múltiples biopsias escalonadas a lo largo de todo el colon.